Clinical trial exclusion criterion:
hepatocellular carcinoma (HCC)

Annotated entities:
- Condition: "hepatocellular carcinoma (HCC)"